Clinical trial inclusion criterion:
Patients undergoing planned trans-femoral TAVI.

Annotated entities:
- Procedure: "trans-femoral TAVI"
- Temporal: "undergoing"
- Qualifier: "planned"